Clinical trial exclusion criterion:
1. Patient has an allergy to nickel.

Entity relations:
- multi("allergy to nickel", "nickel")